Which gene is involved in the development of Barth syndrome?

Tafazzin is a mitochondrial phospholipid transacylase, and its mutations cause Barth syndrome (BTHS)